Clinical trial exclusion criteria:
score level D on the SIGAM mobility grade
have experienced 1 or more falls in the last month before the study
have a residual limb length which does not allow for seven inches clearance of bracket attachment for the PowerFoot
the residual limb must be stable in volume (no change in socket or socket padding in last 6 months) and without pain that limits function
the sound-side (contralateral) lower extremity must be free of impediments that affect gait, range of motion, or limb muscle activity
Any diagnosed cardiovascular, pulmonary, neurological, and/ or orthopedic conditions that would interfere with subject participation

Annotated entities:
- Measurement: "SIGAM mobility grade"
- Value: "level D"
- Multiplier: "1 or more"
- Observation: "falls"
- Temporal: "in the last month before the study"
- Reference_point: "last month before the study"
- Measurement: "residual limb length"
- Value: "does not allow for seven inches clearance of bracket attachment"
- Negation: "does not"
- Non-query-able: "the residual limb must be stable in volume (no change in socket or socket padding in last 6 months) and without pain that limits function"
- Condition: "impediments that affect gait"
- Condition: "impediments that affect range of motion"
- Condition: "impediments that affect limb muscle activity"
- Observation: "lower extremity"
- Negation: "free"
- Condition: "cardiovascular conditions"
- Condition: "pulmonary conditions"
- Condition: "neurological conditions"
- Condition: "orthopedic conditions"
- Qualifier: "interfere with subject participation"
- Undefined_semantics: "interfere with subject participation"
- Subjective_judgement: "interfere with subject participation"